Los miomas del cuerpo uterino que se mantienen en el espesor del miometrio, se denominan:
1. Intramurales.
2. Subserosos.
3. Submurales.
4. Submucosos.

Respuesta correcta: 1. Intramurales.